Clinical trial exclusion criterion:
Current or past history of aspirin-induced asthma or hypersensitivity to NSAIDs.

Entity relations:
- multi("aspirin-induced", "aspirin")
- Has_qualifier("asthma", "aspirin-induced")
- multi("hypersensitivity to NSAIDs", "NSAIDs")
- Has_temporal("asthma", "Current")
- OR("asthma", "hypersensitivity to NSAIDs")
- OR("Current", "past history")